Clinical trial inclusion criterion:
Adults 18-65 years, who are diagnosed with functional neurologic symptom or conversion disorder. If diagnosis of seizure type then video EEG with diagnosis confirmed by board-certified neurologist with subspecialty training in epilepsy and clinical neurophysiology using the criteria of the International Classification of the Epilepsies is required. If diagnosis of motor type, documented and clinically established levels of diagnostic certainty (Williams,1995) confirmed by 2 neurologists is required.

Annotated entities:
- Value: "18-65 years"
- Person: "Adults"
- Person: "18-65 years"
- Condition: "functional neurologic symptom"
- Condition: "conversion disorder"
- Condition: "seizure type"
- Procedure: "video EEG"
- Measurement: "criteria of the International Classification of the Epilepsies"
- Condition: "motor type"
- Non-query-able: "documented and clinically established levels of diagnostic certainty (Williams,1995) confirmed by 2 neurologists is required."